Clinical trial exclusion criterion:
Use of prescription medications not listed above may be allowed at the discretion of the Investigator upon consultation with Rhythm.

Annotated entities:
- Drug: "prescription medications"
- Subjective_judgement: "Use of prescription medications not listed above may be allowed at the discretion of the Investigator upon consultation with Rhythm."